Severe extrahepatic diseases: cardiovascular, respiratory, cerebrovascular and poorly controlled diabetes.

The above is a clinical trial exclusion criterion. Annotated with entity spans:
[Qualifier: Severe] [Condition: extrahepatic diseases]: [Condition: cardiovascular], [Condition: respiratory], [Condition: cerebrovascular] [Grammar_Error: and] [Qualifier: poorly controlled] [Condition: diabetes].